Clinical trial exclusion criterion:
Patient with fever (38C or 100.4F)

Annotated entities:
- Condition: "fever"
- Value: "38C"
- Value: "100.4F"